Patient has had a myocardial infarction within last two months.

The above is a clinical trial exclusion criterion. Annotated with entity spans:
Patient has had a [Condition: myocardial infarction] within [Temporal: last two months].